下列有關抗癲癇藥物 lamotrigine 的敘述，何者錯誤？
A. 其主要作用於電位敏感的鈉離子通道，以安定神經膜及抑制興奮性神經傳導物的釋放作用
B. 其對於局部癲癇、泛發性強直性陣攣性癲癇具有治療的效果
C. 其對 sodium valproate 合併使用時，其體內半衰期會縮短，因此使用劑量需要加倍
D. 其可以用於雙極性疾患（bipolar disorder）之鬱症預防

正確答案：C. 其對 sodium valproate 合併使用時，其體內半衰期會縮短，因此使用劑量需要加倍